在個體是否比較會發作氣喘或過敏病的重要因素中，下列那一個敘述最恰當？
A. 遺傳基因比較重要
B. 環境因子比較重要
C. 遺傳基因和環境因子都很重要
D. 遺傳體質和環境因子都不重要

正確答案：C. 遺傳基因和環境因子都很重要